Clinical trial inclusion criterion:
Male or Female

Entity relations:
- OR("Male", "Female")